Clinical trial inclusion criterion:
Patients with anaemia (males Hb <130 g/L, females <120 g/L) undergoing elective cardiac surgery, and available to receive trial drug 1- 10 weeks prior to surgery

Annotated entities:
- Condition: "anaemia"
- Person: "males"
- Measurement: "Hb"
- Value: "<130 g/L"
- Person: "females"
- Value: "<120 g/L"
- Qualifier: "elective"
- Procedure: "cardiac surgery"
- Mood: "available to receive"
- Drug: "trial drug"
- Temporal: "1- 10 weeks prior to surgery"
- Reference_point: "surgery"
- Procedure: "surgery"